autism spectrum disorder

The above is a clinical trial exclusion criterion. Annotated with entity spans:
[Condition: autism spectrum disorder]